¿Cuál de los siguientes zimógenos se activa por autocatálisis?:
1. Quimotripsinógeno.
2. Tripsinógeno.
3. Proelastasa.
4. Profosfolipasa A2.

Respuesta correcta: 2. Tripsinógeno.